下列何者不應該是兒童調視性內斜視（refractive accommodative esotropia）的治療原則？
A. 儘早戴上度數完全矯正的遠視眼鏡
B. 看近物時，還可加配雙光（bifocals）眼鏡矯正
C. 若併有斜視性弱視，則最好再加上遮閉療法（occlusion therapy）
D. 儘早開刀矯正，一勞永逸，並免得造成弱視

正確答案：D. 儘早開刀矯正，一勞永逸，並免得造成弱視